En el proceso de compresión se produce:
1. Una agregación del polvo a comprimir.
2. Un descenso en la porosidad.
3. Una disminución en el contacto interparticular.
4. Un aumento en la porosidad.
5. Un desempaquetamiento de las partículas.

Respuesta correcta: 2. Un descenso en la porosidad.